Documented left atrial thrombus

The above is a clinical trial exclusion criterion. Annotated with entity spans:
Documented [Condition: left atrial thrombus]